Active substance or alcohol use or dependence that could interfere with participation

The above is a clinical trial exclusion criterion. Annotated with entity spans:
Active [Condition: substance] or [Condition: alcohol use or dependence] [Subjective_judgement: that could interfere with participation]